Clinical trial exclusion criterion:
Pregnant and breastfeeding women.

Annotated entities:
- Pregnancy_considerations: "Pregnant and breastfeeding women"